Clinical trial inclusion criterion:
Men and women 18 years and older;

Entity relations:
- Has_value("years", "18 years and older")
- OR("Men", "women")